Clinical trial exclusion criterion:
Other patients who are not suitable for the study.

Annotated entities:
- Non-query-able: "Other patients who are not suitable for the study"